Clinical trial exclusion criterion:
Presence of any other disease with a life expectancy of <5 years.

Entity relations:
- Has_value("life expectancy", "<5 years")
- Has_qualifier("disease", "any other")
- Has_context("disease", "life expectancy")